Non-ST segement elevation acute coronary syndrome

The above is a clinical trial inclusion criterion. Annotated with entity spans:
[Condition: Non-ST segement elevation] [Condition: acute coronary syndrome]